下列何者與後玻璃體剝離（posterior vitreous detachment）較沒有相關性？
A. 引發裂孔型視網膜剝離
B. 引發視網膜格子狀變性（lattice degeneration）
C. 引發視網膜撕裂（retinal tear）
D. 引發玻璃體出血

正確答案：B. 引發視網膜格子狀變性（lattice degeneration）